Clinical trial exclusion criterion:
Patients who have experienced in-hospital CA;

Annotated entities:
- Condition: "CA"
- Visit: "hospital"
- Qualifier: "in-hospital"